Clinical trial exclusion criterion:
Hepatic disease or biliary tract obstruction, or significant hepatic enzyme elevation (ALT or AST > 3 times upper limit of normal).

Annotated entities:
- Condition: "Hepatic disease"
- Condition: "biliary tract obstruction"
- Condition: "hepatic enzyme elevation"
- Qualifier: "significant"
- Measurement: "ALT"
- Measurement: "AST"
- Value: "> 3 times upper limit of normal"